Dentro de las alteraciones funcionales características de la EPOC, ¿cuál está más relacionada con la afectación enfisematosa del parénquima pulmonar?:
1. Disminución de la capacidad de difusión para el monóxido de carbono.
2. Disminución de los niveles de saturación de la oximetría durante las pruebas de esfuerzo.
3. Patrón obstructivo grave en la espirometría (FEV1<50%).
4. Aumento del volumen residual.

Respuesta correcta: 1. Disminución de la capacidad de difusión para el monóxido de carbono.